¿Cuál de los siguientes polisacáridos es un homopolisacárido?:
1. Quitina.
2. Agarosa.
3. Hialuronano.
4. Heparina.

Respuesta correcta: 1. Quitina.